Serious, uncontrolled disease (including serious psychological disorders) likely to interfere with the study or impact on subject safety.

The above is a clinical trial exclusion criterion. Annotated with entity spans:
Serious, [Condition: uncontrolled disease] (including serious [Condition: psychological disorders]) likely to interfere with the study or impact on subject safety.